Durante el puerperio aparece un exudado útero-vaginal denominado “loquios” que varían a lo largo del proceso. ¿Cómo se denominan cada uno de ellos?
1. Loquios rojos, loquios amarillos y loquios blancos.
2. Loquios rojos, loquios serosos y loquios blancos.
3. Loquios hemáticos, loquios serosos y loquios amarillos.
4. Loquios rojos, loquios blancos y loquios hemáticos.
5. Loquios sanguinolentos, loquios acuosos y loquios blancos.

Respuesta correcta: 2. Loquios rojos, loquios serosos y loquios blancos.